MRSA on a baseline blood culture and on at least 1 additional blood culture after at least 72 hours of vancomycin and/or daptomycin treatment (Cohort B).

The above is a clinical trial inclusion criterion. Annotated with entity spans:
[Observation: MRSA] on a [Temporal: baseline] [Procedure: blood culture] and on [Multiplier: at least 1 additional] [Procedure: blood culture] [Temporal: after at least 72 hours of vancomycin and/or daptomycin treatment] (Cohort B).